Breastfeeding

The above is a clinical trial exclusion criterion. Annotated with entity spans:
[Observation: Breastfeeding]